Clinical trial inclusion criterion:
Postnatal age 2 to 48 hours;

Annotated entities:
- Measurement: "Postnatal age"
- Value: "2 to 48 hours"